What disease is associated with mutations in the MECP2 transcription factor?

Mutations in the MECP2 gene cause the neurodevelopmental disorder Rett syndrome (RTT).